Uncontrolled anxiety, schizophrenia, or other psychiatric disorder that, in the opinion of the investigator, may interfere with study assessments or compliance

The above is a clinical trial exclusion criterion. Annotated with entity spans:
Uncontrolled [Condition: anxiety], [Condition: schizophrenia], or other [Condition: psychiatric disorder] that, in the opinion of the investigator, may interfere with study assessments or compliance